Jaroslav Heyrovky desarrolló la siguiente técnica:
1. Polarografía.
2. Cromatografía gas-sólido.
3. Electroforeis capilar.
4. Polarimetría.

Respuesta correcta: 1. Polarografía.